Clinical trial inclusion criterion:
whose parents or legal guardians accept and sign the consent form

Annotated entities:
- Informed_consent: "whose parents or legal guardians accept and sign the consent form"